Health condition considered unsafe for inclusion (at discretion of PI and/or attending physician)

The above is a clinical trial exclusion criterion. Annotated with entity spans:
[Condition: Health condition] [Qualifier: considered unsafe for inclusion] ([Non-query-able: at discretion of PI and/or attending physician])